一位何杰金氏淋巴瘤（Hodgkin's lymphoma）男性病人，發現有大量蛋白尿（5.8 gm/day/1.73 m2 body surface），血中膽固醇 328 mg/dL，血中白蛋白 1.5 gm/dL，準備接受腎臟切片檢查，他最有可能之腎臟病理變化為：
A. 膜性腎絲球腎炎
B. 局部腎絲球硬化症
C. 微小變化腎病
D. IgA 腎病

正確答案：C. 微小變化腎病